Clinical trial inclusion criterion:
Parent or legal guardian willing to participate, and able to understand and sign the provided informed consent

Annotated entities:
- Informed_consent: "Parent or legal guardian willing to participate, and able to understand and sign the provided informed consent"